下列那一組胺基酸直接參與肌酸（creatine）的生合成？
A. tyrosine, glycine, glutamine
B. glutamate, cysteine, glycine
C. glycine, arginine, methionine
D. aspartate, glycine, cysteine

正確答案：C. glycine, arginine, methionine